Which is the histone residue methylated by MLL1?

Histone H3 at lysine 4 (H3K4)